Clinical trial inclusion criteria:
Has given written informed consent.
Male or female outpatients aged at least 18 years and not more than 45 years.
Has a diagnosis of major depressive disorder by Diagnostic and Statistical Manual of Mental Disorders, Fourth Edition (DSM-IV) criteria.
Current HAMD-17 score = 20 and the duration of the index episode is greater than or equal to four weeks.

Annotated entities:
- Informed_consent: "Has given written informed consent."
- Person: "Male"
- Person: "female"
- Visit: "outpatients"
- Value: "at least 18 years and not more than 45 years"
- Person: "aged"
- Condition: "major depressive disorder"
- Qualifier: "Diagnostic and Statistical Manual of Mental Disorders, Fourth Edition (DSM-IV) criteria"
- Measurement: "HAMD-17"
- Temporal: "Current"
- Value: "score = 20"
- Condition: "index episode"
- Temporal: "greater than or equal to four weeks"